下列藥物作用機轉的敘述，何者正確？
A. Fluoride 會抑制骨母細胞（osteoblast）的活性，抑制骨頭的形成
B. Bisphosphonates 會抑制噬骨細胞（osteoclast）的活性，可用來治療骨質疏鬆症（osteoporosis）
C. Calcitonin 治療骨質疏鬆症的效果較 bisphosphonates 為佳
D. 副甲狀腺素會抑制骨母細胞釋放 RANKL，促進骨頭的蝕骨作用

正確答案：B. Bisphosphonates 會抑制噬骨細胞（osteoclast）的活性，可用來治療骨質疏鬆症（osteoporosis）